followed at the Rothschild Foundation in the Neurology Department

The above is a clinical trial inclusion criterion. Annotated with entity spans:
followed at the [Visit: Rothschild Foundation in the Neurology Department]